Clinical trial inclusion criteria:
Kindergarteners who have joined our outreach dental service will be invited to join this study. Preschool children aged 3-4 years who have tooth decay and are attending the first year of kindergarten will be invited to join this study.

Annotated entities:
- Person: "Kindergarteners"
- Person: "Preschool children"
- Person: "aged"
- Value: "3-4 years"
- Condition: "tooth decay"